Clinical trial exclusion criterion:
BMI > 30

Annotated entities:
- Measurement: "BMI"
- Value: "> 30"